13. Clinically relevant liver function impairment.

The above is a clinical trial exclusion criterion. Annotated with entity spans:
[Parsing_Error: 13.] [Subjective_judgement: Clinically relevant] [Condition: liver function impairment].